當你接收到一位嚴重創傷已插有氣管內管插管（endotracheal tube）的轉診病人時，下列處置何者最 適當？
A. 儘快接上呼吸器
B. 趕快評估其他未被發現的傷害
C. 迅速地拔除氣管內插管並給予足夠的氧氣
D. 檢查氣管內插管的位置是否在正確位置上

正確答案：D. 檢查氣管內插管的位置是否在正確位置上